Clinical trial exclusion criterion:
Subjects with topographic evidence of keratoconus.

Annotated entities:
- Condition: "topographic evidence"
- Condition: "keratoconus"